Clinical trial exclusion criterion:
Life expectancy less than 360 days (12 months)

Entity relations:
- Subsumes("less than 360 days", "less than 12 months")
- Has_value("Life expectancy", "less than 360 days")